腸套疊較好發於何年齡層的兒童？
A. 一個月至三個月
B. 八至十二個月
C. 二至三歲
D. 四歲以上

正確答案：B. 八至十二個月